Individuals who are pregnant or actively breastfeeding

The above is a clinical trial exclusion criterion. Annotated with entity spans:
Individuals who are [Condition: pregnant] or [Temporal: actively] [Observation: breastfeeding]